intact preoperative erectile function with an IIEF = 21 (IIEF-6).

The above is a clinical trial inclusion criterion. Annotated with entity spans:
[Condition: intact] [Temporal: preoperative] erectile function with an [Measurement: IIEF] [Value: = 21] ([Observation: IIEF-6]).